3. Physician and patient have agreed to initiate Lysteda

The above is a clinical trial inclusion criterion. Annotated with entity spans:
3. [Non-query-able: Physician and patient have agreed to initiate Lysteda]